8. Have met DSM V criteria for moderate to severe substance use disorder (excluding nicotine, alcohol and cannabis) in the past, or have met DSM V criteria for moderate to severe substance use disorder for cannabis or alcohol in the past 5 years.

The above is a clinical trial exclusion criterion. Annotated with entity spans:
[Parsing_Error: 8.] Have [Value: met] [Measurement: DSM V criteria] for [Qualifier: moderate to severe] [Condition: substance use disorder] ([Negation: excluding] [Drug: nicotine], [Drug: alcohol] and [Drug: cannabis]) [Temporal: in the past], or have [Value: met] [Measurement: DSM V criteria] for [Qualifier: moderate to severe] [Condition: substance use disorder] for [Drug: cannabis] or [Drug: alcohol] [Temporal: in the past 5 years].